Clinical trial exclusion criteria:
Patients with a history of any other malignancy.
Concomitant treatment with any other anticancer therapy.
Patient have contraindication to chemotherapy(eg.uncontrolled coronarism and heart failure; History of myocardial infarction within the past 6 months, Chronic obstructive pulmonary, uncontrolled epileptic attack and other disease that investigator consider it unsuitable for the chemotherapy)

Annotated entities:
- Condition: "malignancy"
- Qualifier: "any other"
- Temporal: "history"
- Temporal: "Concomitant"
- Procedure: "treatment"
- Qualifier: "any other"
- Procedure: "anticancer therapy"
- Condition: "contraindication"
- Procedure: "chemotherapy"
- Qualifier: "uncontrolled"
- Condition: "coronarism"
- Condition: "heart failure"
- Temporal: "History"
- Condition: "myocardial infarction"
- Temporal: "within the past 6 months"
- Condition: "Chronic obstructive pulmonary"
- Qualifier: "uncontrolled"
- Condition: "epileptic attack"
- Qualifier: "other"
- Condition: "disease"
- Condition: "unsuitable for the chemotherapy"
- Procedure: "chemotherapy"